How are immediate early genes (IEG) defined?

Immediate-early (IE) genes are the first class of viral genes expressed after primary infection or reactivation.